Has received any licensed or other investigational influenza vaccine within 3 months prior to enrollment in this study or expected receipt of any influenza vaccination before the Day 21 blood collection

The above is a clinical trial exclusion criterion. Annotated with entity spans:
Has received any [Qualifier: licensed] or [Qualifier: other investigational] [Drug: influenza vaccine] [Temporal: within 3 months prior to enrollment in this study] or [Observation: expected receipt] of [Drug: any influenza vaccination] [Temporal: before the Day 21] blood collection